Use of immune suppressing medications

The above is a clinical trial exclusion criterion. Annotated with entity spans:
Use of [Drug: immune suppressing medications]